A Mariano le acaban de diagnosticar un cáncer de pulmón con metástasis que le limita en la realización de las actividades instrumentales y requiere la ayuda de otros para realizarlas. Su discurso se centra en expresar culpabilidad por el hábito que le llevo a tener la enfermedad e intenta que usted le diga, que si cambia ahora de forma de vida, podrá demorar o incluso mejorar la progresión de dicha enfermedad y sus consecuencias. ¿En qué fase de duelo de Kubler Ross se encontraría?:
1. Negación.
2. Ira.
3. Aceptación.
4. Negociación.

Respuesta correcta: 4. Negociación.